Clinical trial exclusion criterion:
Has greater than or equal to (>=) Grade 2 peripheral neuropathy, or Grade 1 with pain on clinical examination during the screening period.

Annotated entities:
- Qualifier: "greater than or equal to (>=) Grade 2"
- Condition: "peripheral neuropathy"
- Qualifier: "Grade 1"
- Condition: "pain"